Clinical trial exclusion criterion:
Evidence of ongoing viral infection with HCV, HBV and/or HIV.

Entity relations:
- Subsumes("viral infection", "HCV")
- Has_temporal("viral infection", "ongoing")
- OR("HCV", "HBV", "HIV")